Screening HgA1c blood test > 10.0

The above is a clinical trial exclusion criterion. Annotated with entity spans:
[Temporal: Screening] [Measurement: HgA1c blood test] [Value: > 10.0]